有關甲狀腺眼疾（thyroid eye disease，TED），下列敘述何者錯誤？
A. TED 之嚴重程度與甲狀腺功能亢進（hyperthyroidism）成正比
B. 肇因於體液性自體免疫反應（humoral-mediated autoimmune reaction）
C. 抽菸是造成 TED 的危險因子之一
D. 對進展快速之凸眼症，應先給予高劑量類固醇

正確答案：A. TED 之嚴重程度與甲狀腺功能亢進（hyperthyroidism）成正比